Clinical trial exclusion criterion:
Patients with bleeding disorders including vonWillebrand disease type I.

Entity relations:
- Subsumes("bleeding disorders", "vonWillebrand disease type I")